7. Patients with idiopathic sensory neuropathy must have had pain of at least 3 months' duration

The above is a clinical trial inclusion criterion. Annotated with entity spans:
7. Patients with [Condition: idiopathic sensory neuropathy] must have had [Condition: pain] of [Temporal: at least 3 months' duration]